Clinical trial exclusion criterion:
Bleeding disorder, or receipt of anticoagulants in the 3 weeks preceding inclusion, contraindicating intramuscular vaccination

Annotated entities:
- Condition: "Bleeding disorder"
- Drug: "anticoagulants"
- Temporal: "in the 3 weeks preceding inclusion"
- Reference_point: "inclusion"
- Condition: "contraindicating"
- Procedure: "intramuscular vaccination"